¿Cuál de los siguientes enunciados es correcto con respecto a los hemangiomas hepáticos?
1. Pueden asociarse al síndrome de KasabachMerritt (trombocitopenia y coagulopatía de consumo), especialmente los hemangiomas gigantes.
2. Se debe indicar la exéresis quirúrgica desde el momento que se diagnostique si su diámetro es mayor de 3 cm.
3. La opción terapéutica más recomendable para este tipo de tumor es la embolización percutánea.
4. El mejor método para su confirmación diagnóstica es la biopsia percutánea de la lesión hepática.
5. La RM hepática no suele ofrecer mucha ayuda para su caracterización diagnóstica.

Respuesta correcta: 1. Pueden asociarse al síndrome de KasabachMerritt (trombocitopenia y coagulopatía de consumo), especialmente los hemangiomas gigantes.